History of head injury or stroke,

The above is a clinical trial exclusion criterion. Annotated with entity spans:
[Temporal: History of] [Condition: head injury] or [Condition: stroke],